Clinical trial exclusion criteria:
1) Refusal of epidural catheter 2) Pregnancy 3) Bleeding History 4) Inability to understand how to use the PCA device 5) Medication interfering with blood coagulation 6) Patients allergic to local anesthetics 7) Patient refusal to participate in study 8) Developmental delay

Annotated entities:
- Mood: "Refusal"
- Device: "epidural catheter"
- Condition: "Pregnancy"
- Condition: "Bleeding"
- Temporal: "History"
- Non-query-able: "Inability to understand how to use the PCA device"
- Drug: "Medication"
- Qualifier: "interfering with blood coagulation"
- Condition: "allergic"
- Drug: "local anesthetics"
- Line: "1) Refusal of epidural catheter"
- Line: "2) Pregnancy"
- Line: "3) Bleeding History"
- Line: "4) Inability to understand how to use the PCA device"
- Line: "5) Medication interfering with blood coagulation"
- Line: "6) Patients allergic to local anesthetics"
- Line: "7) Patient refusal to participate in study"
- Line: "8) Developmental delay"
- Non-query-able: "Patient refusal to participate in study"
- Condition: "Developmental delay"